關於糖尿病（diabetes mellitus）之急性併發症（acute complication）之敘述，下列何者錯誤？
A. 通常糖尿病酮酸血症（diabetic ketoacidosis）比高血糖暨高滲透壓狀態（hyperglycemic hyperosmolar state），動脈血 PH 值較低，且一般低於 7.3
B. 血糖濃度在高血糖暨高滲透壓狀態時，通常較糖尿病酮酸血症時為高，且常高於 500 mg/dL
C. 高血糖暨高滲透壓狀態較常見於病弱之老人，而糖尿病酮酸血症較常見於兒童
D. Kussmaul's 呼吸方式通常較常見於高血糖暨高滲透壓狀態時，較少見於糖尿病酮酸血症時

正確答案：D. Kussmaul's 呼吸方式通常較常見於高血糖暨高滲透壓狀態時，較少見於糖尿病酮酸血症時